OR any FEV1 with chronic supplemental oxygen requirement at rest and/or with exertion

The above is a clinical trial inclusion criterion. Annotated with entity spans:
[Non-query-able: OR any FEV1] with [Observation: chronic supplemental oxygen requirement] [Qualifier: at rest] [Parsing_Error: and/or] [Qualifier: with exertion]